Clinical trial inclusion criterion:
Mini-Mental status examination = 24

Entity relations:
- Has_value("Mini-Mental status examination", "= 2")